La cloración y la bromación de una cetona dada promovidas por base ocurren a la misma velocidad debido a que la:
1. Formación del ion enolato es limitante de la velocidad de reacción.
2. Diferente energía de disociación del cloro y el bromo.
3. Pertenencia del electrófilo a la misma familia (halógenos).
4. Ausencia de efecto cinético primario significativo.

Respuesta correcta: 1. Formación del ion enolato es limitante de la velocidad de reacción.